Clinical trial exclusion criterion:
6. History of any hypersensitivity or allergic reaction to any β-lactam antibacterial agent.

Entity relations:
- AND("hypersensitivity", "β-lactam antibacterial agent")
- Has_temporal("hypersensitivity", "History")
- OR("hypersensitivity", "allergic reaction")